一位 47 歲男性開車行經台北市區，恰逢下班交通尖峰時段，突然出現胸悶、氣喘、窒息感、並有瀕臨死亡之感覺。其自行開車至最近醫院的急診室就醫。在該急診室，此患者之理學及實驗室（包括心電圖）檢查均無異常發現。該患者臨床診斷最有可能為下列何者？
A. 慮病症（hypochondriasis）
B. 強迫症（obsessive-compulsive disorder）
C. 憂鬱症（depressive disorder）
D. 恐慌症（panic disorder）

正確答案：D. 恐慌症（panic disorder）